下列何種細胞反應不會發生於骨髓（bone marrow）中？
A. 細胞分裂（cell proliferation）
B. 細胞分化（cell differentiation）
C. 細胞和細胞間互相作用（cellular interaction）
D. 辨識外來抗原（recognition of foreign antigens）

正確答案：D. 辨識外來抗原（recognition of foreign antigens）